Clinical trial exclusion criterion:
Ovarian cancer, adrenal gland tumor, endometrial cancer, cervical cancer, breast cancer

Entity relations:
- OR("Ovarian cancer", "breast cancer", "endometrial cancer", "adrenal gland tumor", "cervical cancer")